Clinical trial exclusion criterion:
Patients with a known congenital or acquired immunodeficiency.

Entity relations:
- Has_qualifier("immunodeficiency", "congenital")
- OR("congenital", "acquired")